Clinical trial exclusion criterion:
History of erythropoietin, i. v. or oral iron therapy, and blood transfusion in previous 12 weeks and/or such therapy planned within the next 6 months.

Annotated entities:
- Drug: "erythropoietin"
- Procedure: "oral iron therapy"
- Procedure: "blood transfusion"
- Temporal: "in previous 12 weeks"
- Mood: "planned"
- Temporal: "within the next 6 months"
- Reference_point: "the next 6 months"
- Procedure: "i. v. iron therapy"